Clinical trial inclusion criterion:
Cancer and Leukemia Group B (CALGB) performance status less than or equal to 2

Entity relations:
- Has_value("Cancer and Leukemia Group B (CALGB) performance status", "less than or equal to 2")